Clinical trial inclusion criterion:
IVF/ICSI fertilisation

Annotated entities:
- Procedure: "IVF fertilisation"
- Procedure: "ICSI fertilisation"